Clinical trial exclusion criterion:
Severe uncorrected visual or auditory handicaps

Annotated entities:
- Qualifier: "Severe"
- Qualifier: "uncorrected"
- Condition: "auditory handicaps"
- Condition: "handicaps visual"